Clinical trial exclusion criterion:
Revision cases

Annotated entities:
- Observation: "Revision cases"